Clinical trial exclusion criterion:
Known or suspected hypersensitivity to trial products or related products

Entity relations:
- Has_mood("hypersensitivity", "Known")
- AND("hypersensitivity", "trial products")
- OR("trial products", "related products")
- OR("Known", "suspected")